Clinical trial exclusion criterion:
Ester local anesthetic allergy, PABA allergy

Annotated entities:
- Drug: "Ester local anesthetic"
- Condition: "allergy"
- Drug: "PABA"
- Condition: "allergy"